下列關於精神分裂症的多巴胺假說（dopamine hypothesis），何者錯誤？
A. 精神分裂症的發生可能與多巴胺功能過剩有關
B. 多巴胺激活物能引起類似精神分裂症的臨床症狀
C. 安非他命與 LSD 導致的精神分裂症狀的機轉都是刺激多巴胺受體所致
D. 在抗精神病藥物治療過程中，臨床症狀的進步與血漿 HVA（homovanillic acid）的降低相關

正確答案：C. 安非他命與 LSD 導致的精神分裂症狀的機轉都是刺激多巴胺受體所致